which mutations of troponin C gene have been found to cause hypertrophic cardiomyopathy?

The following mutations of troponin C gene have been found to cause hypertrophic cardiomyopathy: L29Q; A8V; A31S; E134D; c.363dupG; A23Q; D145E and C84Y